Clinical trial exclusion criterion:
Endoscopically confirmed active upper gastrointestinal hemorrhage on Day 1.

Annotated entities:
- Qualifier: "Endoscopically confirmed"
- Procedure: "Endoscopically"
- Condition: "upper gastrointestinal hemorrhage"
- Temporal: "active"
- Temporal: "on Day 1"
- Reference_point: "Day 1"